在已開發國家大多數的子宮內膜癌診斷時，都是第幾期？
A. 第一期
B. 第二期
C. 第三期
D. 第四期

正確答案：A. 第一期